Neovascularization > 0.75 mm in from of the limbus

The above is a clinical trial exclusion criterion. Annotated with entity spans:
[Condition: Neovascularization] [Value: > 0.75 mm in from of the limbus]